Clinical trial inclusion criterion:
Plan to remain in study area greater than 6 months

Entity relations:
- Has_mood("remain in study area", "Plan")
- Has_temporal("remain in study area", "greater than 6 months")